Clinical trial exclusion criterion:
Patient who have active bleeding disorder, such as intracranial hemorrhage, upper gastrointestinal bleeding, hematuria.

Annotated entities:
- Qualifier: "active"
- Condition: "bleeding disorder"
- Condition: "intracranial hemorrhage"
- Condition: "upper gastrointestinal bleeding"
- Condition: "hematuria"